Clinical trial exclusion criterion:
Previous history of pneumonitis.

Entity relations:
- Has_temporal("pneumonitis", "history")